Clinical trial inclusion criterion:
Capability to understand the informed consent and willing and able to attend study

Annotated entities:
- Post-eligibility: "Capability to understand the informed consent and willing and able to attend study"